Presence of serious cardiac or respiratory disease

The above is a clinical trial exclusion criterion. Annotated with entity spans:
Presence of [Qualifier: serious] [Condition: cardiac] or [Condition: respiratory disease]